Indique cual será la carga neta de un aminoácido con un grupo R neutro para un valor de pH por debajo de su pI:
1. Carga neta negativa.
2. Carga neta positiva.
3. Sin carga.
4. Es necesario conocer el valor exacto del pH para contestar esta pregunta.
5. Es necesario conocer la concentración del aminoácido para contestar esta pregunta.

Respuesta correcta: 2. Carga neta positiva.